Clinical trial exclusion criterion:
Has a history of latent or active granulomatous infection prior to Screening

Annotated entities:
- Qualifier: "active"
- Qualifier: "latent"
- Condition: "granulomatous infection"
- Temporal: "prior to Screening"
- Reference_point: "Screening"